有關膀胱尿道逆流（vesicoureteral reflux）發生原因的敘述，下列何者錯誤？
A. 小孩有尿道感染時容易發生
B. 膀胱三角肌無力（trigonal weakness）
C. 完全尿道複製（complete ureteral duplication）
D. 前膀胱頸局部切除（wedge resection of the anterior vesical neck）

正確答案：D. 前膀胱頸局部切除（wedge resection of the anterior vesical neck）